Platelet count ≥ 75,000/mcL

The above is a clinical trial inclusion criterion. Annotated with entity spans:
[Measurement: Platelet count] [Value: ≥ 75,000/mcL]